¿Cuál es la afirmación correcta acerca de la noción de “paciente identificado”?:
1. Formulada por el psicoanálisis, refleja la idea de que lo que requiere ser cambiado son los patrones de interacción en la familia.
2. Se refiere a la persona que solicita la ayuda o el tratamiento.
3. Describe una situación común en la que los pacientes se identifican con su padre.
4. Equivale a la noción de contratransferencia.
5. Refleja la idea de que los síntomas son expresiones de un sistema disfuncional.

Respuesta correcta: 5. Refleja la idea de que los síntomas son expresiones de un sistema disfuncional.